Clinical trial exclusion criterion:
Terminal patient

Annotated entities:
- Person: "patient"
- Qualifier: "Terminal"